Clinical trial inclusion criterion:
Is between 18 and 40 years of age (inclusive)

Entity relations:
- Has_value("age", "between 18 and 40 years (inclusive)")